Clinical trial exclusion criterion:
Subject requiring a spine DEXA (i.e., patients with SCORE of = 6) with a T Score less than -2.0 at the index level. For patients with a herniation at L5/S1, the average T score of L1-L4 shall be used.

Entity relations:
- Has_value("SCORE", "= 6")
- Has_value("T Score", "less than -2.0")
- Subsumes("spine DEXA", "SCORE")
- Has_mood("spine DEXA", "requiring")
- Has_qualifier("T Score", "index level")
- Has_qualifier("herniation", "L5/S1")
- Has_qualifier("average T score", "L1-L4")
- AND("average T score", "shall be used")
- AND("herniation", "average T score")
- AND("spine DEXA", "T Score")